Clinical trial inclusion criterion:
gestational age between 20 weeks and 23 weeks and 6 days

Annotated entities:
- Measurement: "gestational age"
- Value: "between 20 weeks and 23 weeks and 6 days"